Clinical trial exclusion criterion:
The presence of respiratory, cardio-vascular insufficiency, impaired liver and kidney function, established during a physical examination at visit number 1;

Entity relations:
- Has_temporal("respiratory insufficiency", "at visit number 1")
- OR("respiratory insufficiency", "impaired liver", "cardio-vascular insufficiency", "impaired kidney function")